下列何種病毒感染會造成單核球增多、嗜異性抗體（heterophile antibody）陰性以及肝炎的症狀？
A. Epstein-Barr virus
B. Human herpesvirus-6
C. Human T-cell lymphotropic virus type 1
D. Cytomegalovirus

正確答案：D. Cytomegalovirus